Where is the TAZ (G4.5) is located in humans?

TAZ gene (G4.5) is located on Xq28 in humans.